Clinical trial exclusion criteria:
Age < 20 or > 35 years.
Body mass index (BMI) < 18.5 kg/m2 or > 25 kg/m2.
Presence of any infertility factor other than anovulatory PCOS.
Previous history of ovarian surgery or surgical removal of one ovary.
Previous exposure to cytotoxic drugs or pelvic irradiation.
Oral hypoglycemic or hormonal therapy either currently or in the preceding 3 months.
Metabolic or hormonal abnormalities

Annotated entities:
- Person: "Age"
- Value: "< 20 or > 35 years"
- Measurement: "Body mass index"
- Measurement: "BMI"
- Value: "< 18.5 kg/m2 or > 25 kg/m2"
- Condition: "infertility factor"
- Negation: "other than"
- Condition: "anovulatory PCOS"
- Procedure: "ovarian surgery"
- Procedure: "surgical removal"
- Qualifier: "ovary"
- Multiplier: "one"
- Condition: "exposure"
- Drug: "cytotoxic drugs"
- Procedure: "pelvic irradiation"
- Procedure: "hormonal therapy"
- Procedure: "hypoglycemic therapy"
- Qualifier: "Oral"
- Temporal: "preceding 3 months"
- Condition: "hormonal abnormalities"
- Condition: "Metabolic abnormalities"